先天視網膜剝離症通常是由於下列何者沒有癒合所造成？
A. 視杯（optic cup）的內外層
B. 視網膜與水晶體之間
C. 色素層與脈絡層／鞏膜間
D. 眼柄（optic stalk）基部

正確答案：A. 視杯（optic cup）的內外層